Meets criteria for Major Depressive Episode, by Diagnostic Statistical Manual of Mental Disorder - IV (TR) criteria

The above is a clinical trial exclusion criterion. Annotated with entity spans:
[Value: Meets] criteria for [Condition: Major Depressive Episode], by [Measurement: Diagnostic Statistical Manual of Mental Disorder - IV (TR) criteria]